Clinical trial exclusion criterion:
Multiple pain sources and multifactorial pain sources that complicated or confound diagnosing the SI joint as the primary and predominant pain generator that may contribute to low back pain (including but not limited to: lumbar diagnosis, lumbar radiculopathy, intra or extra-articular hip pathology to include acetabulum and femoral head, lumbo-sacral joint pathology, intervertebral disk disease, spondylolisthesis/spondylosis/spondylolysis of lumbar vertebra)

Annotated entities:
- Condition: "Multiple pain sources"
- Condition: "multifactorial pain sources"
- Non-representable: "that complicated or confound diagnosing the SI joint as the primary and predominant pain generator that may contribute to low back pain"
- Condition: "lumbar diagnosis"
- Condition: "lumbar radiculopathy"
- Condition: "extra-articular hip pathology"
- Condition: "intra -articular hip pathology"
- Condition: "acetabulum pathology"
- Condition: "femoral head pathology"
- Condition: "lumbo-sacral joint pathology"
- Condition: "intervertebral disk disease"
- Condition: "spondylolisthesis"
- Condition: "spondylosis"
- Condition: "spondylolysis of lumbar vertebra"